一位 56 歲女性先前並無任何心臟病史，目前亦無任何症狀及心臟功能不良。影像學檢查發現二尖瓣 （mitral valve）的瓣膜有兜狀隆起（hooding）並呈左心房脫垂（mitral prolapse）現象。下列何者最可能代表其二尖瓣膜的變化？
A. 纖維化及鈣化
B. 類纖維蛋白壞死及水腫
C. 黏液變性
D. 瓣膜發炎及破壞

正確答案：C. 黏液變性